Fertile men and women of childbearing potential must agree to use an effective method of birth control from providing signed consent and for 120 days after last study drug administration. Women of childbearing potential include pre-menopausal women and women within the first 2 years of the onset of menopause. Women of childbearing potential must have a negative pregnancy test ≤ 72 hours prior to Day 1 of study.

The above is a clinical trial inclusion criterion. Annotated with entity spans:
[Non-query-able: Fertile men and women of childbearing potential must agree to use an effective method of birth control from providing signed consent and for 120 days after last study drug administration.] [Non-query-able: Women of childbearing potential include pre-menopausal women and women within the first 2 years of the onset of menopause.] [Person: Women] of [Condition: childbearing potential] must have a [Value: negative] [Measurement: pregnancy test] [Temporal: ≤ 72 hours prior to Day 1] of study.